Clinical trial exclusion criterion:
(iii) for subjects enrolled at Indian sites: oral poliomyelitis vaccine (OPV) received during National Immunization Days (NIDs) and supplementary immunization activity days (SIADs)

Annotated entities:
- Visit: "Indian sites"
- Drug: "oral poliomyelitis vaccine (OPV)"
- Temporal: "during National Immunization Days (NIDs)"
- Reference_point: "National Immunization Days (NIDs)"
- Temporal: "during supplementary immunization activity days (SIADs)"
- Reference_point: "supplementary immunization activity days (SIADs)"